Clinical trial exclusion criteria:
Unable to participate for administrative reasons
Psychiatric troubles
Pain at rest or critical limb ischemia
Unable to walk (ex: wheelchair subjects)

Annotated entities:
- Observation: "Unable to participate"
- Qualifier: "administrative reasons"
- Condition: "Psychiatric troubles"
- Condition: "Pain at rest"
- Condition: "critical limb ischemia"
- Condition: "Unable to walk"
- Observation: "wheelchair subjects"